Fasting LDL-C =70mg/dL or = 160mg/dL at the randomization visit

The above is a clinical trial inclusion criterion. Annotated with entity spans:
[Measurement: Fasting LDL-C] [Value: =70mg/dL] or [Value: = 160mg/dL] [Temporal: at the randomization visit]